What disease does BCG immunotherapy used to treat?

Bacillus Calmette-guérin (BCG) immunotherapy is used in the treatment of bladder cancer.